Clinical trial exclusion criteria:
Failure to have fully recovered (that is, less than or equal to [<=] Grade 1 toxicity) from the reversible effects of prior chemotherapy.
Major surgery within 14 days before enrollment.
Radiotherapy within 14 days before enrollment (if the involved field is small, 7 days will be considered a sufficient interval between treatment and administration of the ixazomib.)
Central nervous system involvement.
Infection requiring systemic antibiotic therapy or other serious infection within 14 days before study enrollment.
Evidence of current uncontrolled cardiovascular conditions, including uncontrolled hypertension, uncontrolled cardiac arrhythmias, symptomatic congestive heart failure, unstable angina, or myocardial infarction within the past 6 months.
Systemic treatment, within 14 days before the first dose of ixazomib, with strong cytochrome P450 3A (CYP3A) inducers (rifampin, rifapentine, rifabutin, carbamazepine, phenytoin, phenobarbital), or use of Ginkgo biloba or St. John's wort.
Ongoing or active systemic infection, active hepatitis B or C virus infection, or known human immunodeficiency virus positive.
Diagnosed or treated for another malignancy within 2 years before study enrollment or previously diagnosed with another malignancy and have any evidence of residual disease. Participants with non-melanoma skin cancer or carcinoma in situ of any type are not excluded if they have undergone complete resection.
Has greater than or equal to (>=) Grade 2 peripheral neuropathy, or Grade 1 with pain on clinical examination during the screening period.
PD on first-line therapy.
Participation in other interventional clinical trials, including those with other investigational agents not included in this trial, within 30 days of the start of this trial and throughout the duration of this trial. Non-interventional trials (that is, observational trials) are permitted at any time point.

Annotated entities:
- Negation: "Failure"
- Condition: "fully recovered"
- Value: "less than or equal to [<=] Grade 1"
- Measurement: "toxicity"
- Procedure: "chemotherapy"
- Procedure: "Major surgery"
- Temporal: "within 14 days before enrollment"
- Procedure: "Radiotherapy"
- Temporal: "within 14 days before enrollment"
- Observation: "involved field is small"
- Temporal: "7 days"
- Condition: "Central nervous system involvement"
- Condition: "Infection"
- Procedure: "systemic antibiotic therapy"
- Qualifier: "other"
- Qualifier: "serious"
- Condition: "infection"
- Temporal: "within 14 days before study enrollment"
- Condition: "cardiovascular conditions"
- Qualifier: "uncontrolled"
- Condition: "hypertension"
- Qualifier: "uncontrolled"
- Condition: "cardiac arrhythmias"
- Qualifier: "symptomatic"
- Condition: "congestive heart failure"
- Condition: "unstable angina"
- Condition: "myocardial infarction"
- Temporal: "within the past 6 months"
- Qualifier: "uncontrolled"
- Temporal: "current"
- Procedure: "Systemic treatment"
- Temporal: "within 14 days before the first dose of ixazomib"
- Reference_point: "the first dose of ixazomib"
- Drug: "ixazomib"
- Drug: "strong cytochrome P450 3A (CYP3A) inducers"
- Drug: "rifampin"
- Drug: "rifapentine"
- Drug: "rifabutin"
- Drug: "carbamazepine"
- Drug: "phenytoin"
- Drug: "phenobarbital"
- Drug: "Ginkgo biloba"
- Drug: "St. John's wort"
- Qualifier: "active"
- Temporal: "Ongoing"
- Condition: "systemic infection"
- Qualifier: "active"
- Condition: "hepatitis B virus infection"
- Condition: "C virus infection"
- Measurement: "human immunodeficiency virus"
- Value: "positive"
- Condition: "malignancy"
- Temporal: "within 2 years before study enrollment"
- Temporal: "previously"
- Qualifier: "another"
- Condition: "malignancy"
- Condition: "residual disease"
- Mood: "any evidence of"
- Condition: "non-melanoma skin cancer"
- Condition: "carcinoma in situ"
- Qualifier: "any type"
- Negation: "not excluded"
- Procedure: "complete resection"
- Qualifier: "greater than or equal to (>=) Grade 2"
- Condition: "peripheral neuropathy"
- Qualifier: "Grade 1"
- Condition: "pain"
- Drug: "PD"
- Qualifier: "first-line therapy"
- Competing_trial: "Participation in other interventional clinical trials"
- Temporal: "within 30 days of the start of this trial"
- Temporal: "throughout the duration of this trial"
- Reference_point: "the start of this trial"
- Reference_point: "the duration of this trial"